Poor venous access or inability to tolerate venipuncture.

The above is a clinical trial exclusion criterion. Annotated with entity spans:
[Condition: Poor venous access] or [Condition: inability to tolerate venipuncture].